Body mass index > 35

The above is a clinical trial exclusion criterion. Annotated with entity spans:
[Measurement: Body mass index] [Value: > 35]